A combination of which two drugs was tested in the IMbrave150 trial?

IMbrave150 trial tested a combination of atezolizumab and bevacizumab for advanced hepatocellular carcinoma.